What receptor is associated with the protein encoded by the Spätzle gene?

Currently Spatzle (Spz) has been identified and characterized as a ligand for the Toll-1 receptor